Clinical trial inclusion criterion:
Current PTSD diagnosis

Annotated entities:
- Condition: "PTSD"
- Temporal: "Current"